La tasa de filtración glomerular aumenta cuando:
1. Aumenta la resistencia en la arteriola aferente glomerular.
2. Disminuye la resistencia en la arteriola eferente glomerular.
3. Aumenta la actividad de los nervios simpáticos renales.
4. Se produce obstrucción de la vía urinaria.
5. Disminuye la concentración de las proteínas plasmáticas.

Respuesta correcta: 5. Disminuye la concentración de las proteínas plasmáticas.